De novo lesion

The above is a clinical trial inclusion criterion. Annotated with entity spans:
[Condition: De novo lesion]